Clinical trial exclusion criteria:
Exclusion criteria include patients following resuscitation from cardiac arrest who are treated on the cooling protocol
patients who have suffered a neurologic event (seizure, stroke) or who have baseline dementia, both of which could limit delirium assessment
patients with child class B and C liver disease
patients with known allergy to study medications.

Annotated entities:
- Procedure: "resuscitation from cardiac arrest"
- Qualifier: "cooling protocol"
- Condition: "neurologic event"
- Condition: "seizure"
- Condition: "stroke"
- Condition: "baseline dementia"
- Non-representable: "both of which could limit delirium assessment"
- Measurement: "child class"
- Condition: "liver disease"
- Value: "B"
- Value: "C"
- Condition: "allergy"
- Drug: "study medications"